Clinical trial exclusion criterion:
Treated with greater than 10 mg of prednisone (or equivalent) daily in the last 6 months

Entity relations:
- Has_multiplier("prednisone", "greater than 10 mg")
- Has_multiplier("prednisone", "daily")
- Has_temporal("prednisone", "in the last 6 months")